Una colitis pseudomembranosa producida después de un consumo de antibióticos está frecuentemente asociada a una infección por:
1. Salmonella typhimurium.
2. Vibrio cholerae.
3. Shigella dysenteriae.
4. Clostridium difficile.

Respuesta correcta: 4. Clostridium difficile.